Según las investigaciones derivadas del modelo de Eysenck, existen evidencias de que los extravertidos, en comparación con los introvertidos:
1. Rinden mejor en tareas de vigilancia.
2. Tienen mayor secreción salivar ante la prueba del zumo de limón.
3. Tienen mayor necesidad de estimulación.
4. Tienen menor tolerancia al dolor.

Respuesta correcta: 3. Tienen mayor necesidad de estimulación.